執行麻醉前須審慎評估病人氣道（airway），下列何者不是放置氣管內管困難的病人？
A. 可以看到咽喉結構 Mallampati 分類第一級的病人
B. 過度肥胖的病人
C. 頸椎受傷的病人
D. 頸椎活動度受限的僵直性脊椎炎（ankylosing spondylitis）的病人

正確答案：A. 可以看到咽喉結構 Mallampati 分類第一級的病人